有關睪丸炎（orchitis）與副睪丸炎（epididymitis）的描述，下列何者錯誤？
A. 淋病與結核病的感染常先發生於睪丸，而梅毒則常從副睪丸開始
B. 腮腺炎的感染好發於學齡兒童，這個年齡群極少有睪丸炎的併發症發生
C. 35歲以上的年齡群副睪丸炎以大腸桿菌與綠膿桿菌的感染為主
D. 梅毒的感染可於顯微鏡下觀察到大量漿細胞與淋巴球的浸潤

正確答案：A. 淋病與結核病的感染常先發生於睪丸，而梅毒則常從副睪丸開始